Clinical trial inclusion criteria:
Patients undergoing surgery with general anesthesia,
Patients weighing = 80 pounds who are not -intubated prior to surgery,
Patients who are able to give informed consent.

Annotated entities:
- Procedure: "surgery"
- Temporal: "undergoing"
- Qualifier: "general anesthesia"
- Procedure: "general anesthesia"
- Measurement: "weighing"
- Value: "= 80 pounds"
- Negation: "not"
- Procedure: "intubated"
- Temporal: "prior to surgery"
- Reference_point: "surgery"
- Procedure: "surgery"
- Informed_consent: "Patients who are able to give informed consent"